Clinical trial exclusion criterion:
Patient is unable to complete 3 minutes of unloaded peddling on cycle ergometer

Entity relations:
- Has_qualifier("unable to complete", "3 minutes of unloaded peddling on cycle ergometer")